Clinical trial inclusion criterion:
T1-3 N0 M0 adenocarcinoma of the prostate

Entity relations:
- Has_value("N", "0")
- Has_value("M", "0")
- Has_value("T", "1-3")
- Has_qualifier("adenocarcinoma", "prostate")
- AND("adenocarcinoma", "T")
- AND("adenocarcinoma", "N")
- AND("adenocarcinoma", "M")